Clinical trial inclusion criterion:
Healthy patients (ASA I)

Entity relations:
- Has_value("ASA", "I")
- Subsumes("Healthy patients", "ASA")